Clinical trial exclusion criterion:
Type 2 myocardial infarction

Annotated entities:
- Condition: "Type 2 myocardial infarction"